Clinical trial inclusion criterion:
With the presence of a non-carious cervical lesion (LCNCs) that needs to be restored. This lesion should be non-carious, non-retentive, with at least 1 mm and up to 3 mm depth, should involve both enamel and dentin of vital teeth without mobility, and present hypersensitivity;

Entity relations:
- Has_mood("restored", "needs to be")
- Has_value("depth", "at least 1 mm and up to 3 mm")
- Has_qualifier("lesion", "non-carious")
- Has_qualifier("lesion", "non-retentive")
- AND("lesion", "depth")
- Has_qualifier("lesion", "involve both enamel and dentin")
- AND("lesion", "hypersensitivity")
- OR("non-carious cervical lesion (LCNCs)", "restored")